Clinical trial exclusion criterion:
Received immunoglobulins or any blood products within 180 days prior to informed consent.

Annotated entities:
- Drug: "immunoglobulins"
- Drug: "blood products"
- Temporal: "within 180 days prior to informed consent"
- Reference_point: "informed consent"